Patient subjected to chemical or radiotherapy

The above is a clinical trial exclusion criterion. Annotated with entity spans:
Patient subjected to [Procedure: chemical] or [Procedure: radiotherapy]